Clinical trial exclusion criterion:
Impairment of gastrointestinal (GI) function or GI disease that may significantly alter the absorption of dovitinib

Entity relations:
- Has_qualifier("Impairment of gastrointestinal (GI) function", "may significantly alter the absorption of dovitinib")
- OR("Impairment of gastrointestinal (GI) function", "GI disease")